一名 28 歲男性發現皮膚上有許多 epidermal cysts，進一步檢查發現在下頷骨有一個骨瘤（osteoma），同時在大腸有無數個腺性息肉（adenomatous polyps）。下列何者是最可能的診斷？
A. 家族性腺瘤息肉症（Familial adenomatous polyposis）
B. Gardner 症候群
C. Peutz-Jeghers 症候群
D. Turcot 症候群

正確答案：B. Gardner 症候群